Clinical trial inclusion criterion:
American Society of Anesthesiologists Physical Status (ASA PS) score of I or II.

Annotated entities:
- Measurement: "American Society of Anesthesiologists Physical Status score"
- Measurement: "ASA PS"
- Value: "I or II"